Clinical trial exclusion criterion:
History of cognitive impairment or dysfunction, including a history of dementia, Alzheimer's disease, stroke with residual cognitive deficits, cognitive dysfunction related to alcohol or substance abuse, or cognitive dysfunction related to prior treatment for any cancer.

Entity relations:
- AND("stroke", "residual cognitive deficits")
- Has_qualifier("cancer", "any")
- AND("treatment", "cancer")
- Has_temporal("treatment", "prior")
- AND("cognitive dysfunction", "treatment")
- Subsumes("cognitive impairment", "dementia")
- OR("dementia", "cognitive dysfunction", "Alzheimer's disease", "substance abuse", "alcohol abuse", "cognitive dysfunction", "stroke")
- OR("cognitive impairment", "cognitive dysfunction")